Where are the PUX proteins found?

PUX proteins specifically associate with the nucleoskeleton underneath the INM.